Clinical trial exclusion criteria:
Acute pain (less than 3 months in duration)
Previous serious adverse event or hypersensitivity to cannabis or cannabinoids
Inability to understand and comply with the instructions of the study
Presence of significant cardiac disease (history of unstable ischemic heart disease, heart failure, severe and uncontrolled hypertension) that, in the opinion of the investigator, would put the patient at risk of a clinically significant arrhythmia or myocardial infarction
Current substance use disorder according to the Diagnostic and Statistical Manual of Mental Disorders Fifth Edition (DSM 5)
Life-time history of dependence on cannabis or diagnosis of cannabis use disorder (CUD) according to the DSM 5
Life-time history of DSM 5 schizophrenia, bipolar disorder, or previous psychosis with or intolerance to cannabinoids
Current or history of suicidal ideation
Pregnant, breast-feeding or female patients of child-bearing potential and male patients whose partner is of child-bearing potential, unless willing to ensure that they or their partner use effective contraception
Hepatic impairment (aspartate aminotransferase more than three times normal) or renal function impairment (serum creatinine level >133 µmol/L, Estimated Glomerular Filtration Rate (eGFR) <60)
Cognitive impairment according to MiniCog
The patient is currently using or has used cannabinoid based medications within 90 days of study entry and is unwilling to abstain for the duration of the study
Positive urine drug screen for cannabinoids and other potential abuse substances (e.g. alcohol, cocaine, amphetamines and methamphetamines, unprescribed opioids)
Participation in another clinical trial within 30 days of enrolment in our trial

Annotated entities:
- Condition: "pain"
- Measurement: "duration"
- Value: "less than 3 months"
- Qualifier: "Acute"
- Condition: "hypersensitivity"
- Drug: "cannabis"
- Drug: "cannabinoids"
- Condition: "adverse event"
- Qualifier: "serious"
- Non-query-able: "Inability to understand and comply with the instructions of the study"
- Condition: "cardiac disease"
- Qualifier: "significant"
- Condition: "unstable ischemic heart disease"
- Condition: "heart failure"
- Qualifier: "severe"
- Qualifier: "uncontrolled"
- Condition: "hypertension"
- Temporal: "history"
- Qualifier: "clinically significant"
- Condition: "arrhythmia"
- Condition: "myocardial infarction"
- Mood: "at risk of"
- Condition: "substance use disorder"
- Qualifier: "Diagnostic and Statistical Manual of Mental Disorders Fifth Edition (DSM 5)"
- Condition: "dependence on cannabis"
- Condition: "cannabis use disorder (CUD)"
- Qualifier: "DSM 5"
- Qualifier: "DSM 5"
- Condition: "schizophrenia"
- Condition: "bipolar disorder"
- Condition: "psychosis"
- Condition: "intolerance"
- Drug: "cannabinoids"
- Condition: "suicidal ideation"
- Temporal: "Current"
- Temporal: "history"
- Pregnancy_considerations: "Pregnant, breast-feeding or female patients of child-bearing potential and male patients whose partner is of child-bearing potential, unless willing to ensure that they or their partner use effective contraception"
- Condition: "Hepatic impairment"
- Measurement: "Estimated Glomerular Filtration Rate (eGFR)"
- Value: "<60"
- Measurement: "aspartate aminotransferase"
- Value: "more than three times normal"
- Condition: "renal function impairment"
- Measurement: "serum creatinine level"
- Value: ">133 µmol/L"
- Condition: "Cognitive impairment"
- Procedure: "MiniCog"
- Drug: "cannabinoid based medications"
- Temporal: "within 90 days of study entry"
- Measurement: "urine drug screen"
- Value: "Positive"
- Drug: "cannabinoids"
- Drug: "alcohol"
- Drug: "cocaine"
- Drug: "amphetamines"
- Drug: "methamphetamines"
- Drug: "opioids"
- Qualifier: "unprescribed"
- Competing_trial: "Participation in another clinical trial within 30 days of enrolment in our trial"